History of kidney stones

The above is a clinical trial exclusion criterion. Annotated with entity spans:
[Temporal: History] of [Condition: kidney stones]